Clinical trial exclusion criterion:
documented allergy to iodine or shellfish

Entity relations:
- AND("allergy", "iodine")
- OR("iodine", "shellfish")